Ongoing treatment with cyclosporine within 2 weeks;

The above is a clinical trial exclusion criterion. Annotated with entity spans:
[Temporal: Ongoing] [Procedure: treatment] with [Drug: cyclosporine] [Temporal: within 2 weeks];